Clinical trial exclusion criterion:
Severe pulmonary disease requiring consistent treatment

Entity relations:
- Has_mood("consistent treatment", "requiring")
- Has_qualifier("pulmonary disease", "Severe")
- AND("pulmonary disease", "consistent treatment")